凝血因子X（coagulation factor X）活化為Xa的反應中，下列何因子沒有參與？
A. factor Va
B. factor VIIa
C. factor VIIIa
D. factor IXa

正確答案：A. factor Va